一位 68 歲女性因為左側退化性膝關節炎入院，準備明天接受人工膝關節置換手術，你正好是今天負責診視這位病患的值班醫師，請問下列那個處置在這位病患而言是正確的？
A. 應標示手術部位，並且協助病人將腿毛剃除，以降低傷口感染率
B. 應儘速投予預防性抗生素，以減低感染率
C. 應審視病患與各項檢查結果，判斷病患病情是否改變、不適合接受手術
D. 應給予安眠藥或鎮靜劑，以免因恐慌而延誤手術

正確答案：C. 應審視病患與各項檢查結果，判斷病患病情是否改變、不適合接受手術